Clinical trial exclusion criterion:
Life limiting disease or substance abuse which may affect participation

Annotated entities:
- Condition: "Life limiting disease"
- Condition: "substance abuse"
- Qualifier: "may affect participation"